Clinical trial exclusion criterion:
Co-infected with HCV, HIV or other viral hepatitis,

Entity relations:
- Has_qualifier("viral hepatitis", "other")
- Has_temporal("HCV", "Co-infected")
- OR("HCV", "HIV", "viral hepatitis")